Clinical trial exclusion criterion:
Documented history of liver or kidney problems

Annotated entities:
- Condition: "kidney problems"
- Condition: "liver problems"
- Temporal: "history"